Vasculitis

The above is a clinical trial exclusion criterion. Annotated with entity spans:
[Condition: Vasculitis]